no co-operation or inadequate finnish language skills

The above is a clinical trial exclusion criterion. Annotated with entity spans:
[Negation: no] [Observation: co-operation] or [Observation: inadequate finnish language skills]